一位 40歲女性主訴有多尿及多喝的症狀，尿液中未偵測到glucose。她接受隔夜的尿液限水 檢查試 。限水一夜後，病患呈現神智障礙及虛弱狀況。其血中鈉離子濃度為156 mEq/L，血漿ADH濃度偏高，尿液之滲透壓數值為90 mOsm/L。下列何者為其最可能之診斷？
A. 糖尿病（diabetes mellitus）
B. 中樞性尿崩症（central diabetes insipidus）
C. 腎因性尿崩症（nephrogenic diabetes insipidus）
D. 原發性醛固酮過多症（primary aldosteronism）

正確答案：C. 腎因性尿崩症（nephrogenic diabetes insipidus）